Clinical trial inclusion criterion:
Diastolic blood pressure 60-90 mmHg

Annotated entities:
- Measurement: "Diastolic blood pressure"
- Value: "60-90 mmHg"